patient well responders

The above is a clinical trial inclusion criterion. Annotated with entity spans:
patient [Condition: well responders]